Clinical trial exclusion criterion:
Use of Belviq XR within 6 months before Screening or hypersensitivity to Belviq XR or any of the excipients

Entity relations:
- Has_index("within 6 months before Screening", "Screening")
- Has_qualifier("Belviq XR", "or any of the excipients")
- AND("hypersensitivity", "Belviq XR")
- Has_temporal("Belviq XR", "within 6 months before Screening")
- OR("Belviq XR", "hypersensitivity")